El hierro es un oligoelemento necesario para una amplia variedad de funciones biológicas, una de ellas es:
1. Trasportar a través de la sangre el oxígeno de los alveolos pulmonares a las células de órganos y sistemas corporales.
2. Transportar a través de la sangre distintas sustancias de los tejidos hasta los riñones.
3. Transportar a través de la sangre los micronutrientes esenciales para el funcionamiento de órganos y sistemas corporales.
4. Transportar a través de la sangre los lípidos necesarios para formar el tejido adiposo que actúa como aislante térmico.

Respuesta correcta: 1. Trasportar a través de la sangre el oxígeno de los alveolos pulmonares a las células de órganos y sistemas corporales.